Clinical trial exclusion criterion:
History of renal insufficiency or requiring dialysis.

Entity relations:
- Has_mood("dialysis", "requiring")
- Has_temporal("renal insufficiency", "History")
- OR("renal insufficiency", "dialysis")